Clinical trial exclusion criterion:
Contraindications and/or known hypersensitivity to the active substance and/or any of the excipients of epoetin beta treatment

Annotated entities:
- Condition: "Contraindications"
- Condition: "hypersensitivity"
- Procedure: "epoetin beta treatment"